下面有關參數（parameter）信賴區間估計的敘述何者正確？
A. 95% 單尾信賴區間與 95% 雙尾信賴區間的顯	水準 α 不同
B. 簡單線性迴歸係數的 95% 信賴區間沒有包含 0 代表該解釋變項與反應變項有顯	的線性
C. 勝算比（Odds Ratio）的 95% 信賴區間沒有包含 0 代表該解釋變項與反應變項有關聯
D. 檢定學生近視的比例是否與 10 年前相同，用信賴區間法進行檢定與假說檢定之 Z 檢定結論不同

正確答案：B. 簡單線性迴歸係數的 95% 信賴區間沒有包含 0 代表該解釋變項與反應變項有顯	的線性